The participant is required to take any of the excluded medications or treatments.

The above is a clinical trial exclusion criterion. Annotated with entity spans:
[Post-eligibility: The participant is required to take any of the excluded medications or treatments.]